5. Participating in the other clinical trial within 30 days;

The above is a clinical trial exclusion criterion. Annotated with entity spans:
5. [Context_Error: Participating in the other clinical trial within 30 days;]